Clinical trial exclusion criterion:
Active smoking during the last 12 months from screening date.

Annotated entities:
- Condition: "Active smoking"
- Temporal: "Active"
- Temporal: "during the last 12 months from screening date"
- Reference_point: "screening date"